Clinical trial inclusion criterion:
High-risk for VTE

Entity relations:
- Has_mood("VTE", "High-risk")